早產兒壞死性腸炎（necrotizing enterocolitis）的早期診斷，腹部X光檢查最典型的發現為異常氣體聚積於何處？
A. 腸腔內（intraluminal）
B. 腸壁中（intramural）
C. 腸壁外腹膜內（intraperitoneal）
D. 腹壁中（abdominal wall）

正確答案：B. 腸壁中（intramural）